Patient with evidence of endoscopic active proctitis or distal proctosigmoiditis (Montreal classification E1 or E2 defined by an involvement not exceeding 25 cm from the anal margin) within 6 months before study inclusion.

The above is a clinical trial inclusion criterion. Annotated with entity spans:
Patient with evidence of [Procedure: endoscopic] [Condition: active proctitis] or [Condition: distal proctosigmoiditis] ([Measurement: Montreal classification] [Value: E1 or E2] defined by an [Qualifier: involvement not exceeding 25 cm from the anal margin]) [Temporal: within 6 months before study inclusion].